Clinical trial inclusion criterion:
Any patients that will be submitted to phacoemulsification surgery in the Hospital de Clinicas of State University of Campinas (BRAZIL)

Annotated entities:
- Procedure: "phacoemulsification surgery"
- Mood: "will be submitted to"
- Visit: "Hospital de Clinicas of State University of Campinas (BRAZIL)"